Clinical trial exclusion criterion:
Any previous treatment with sunitinib

Annotated entities:
- Drug: "sunitinib"